Clinical trial exclusion criterion:
Emergency cases as determined by the investigator or physician

Annotated entities:
- Non-query-able: "Emergency cases as determined by the investigator or physician"